Clinical trial inclusion criteria:
Thoracoscopic surgery candidate.
Over 18 years old.
No known allergy to Bupivacaine.
Patient is able to read understand and singe an inform consent.

Annotated entities:
- Procedure: "Thoracoscopic surgery"
- Mood: "candidate"
- Value: "Over 18 years old"
- Person: "old"
- Condition: "allergy"
- Drug: "Bupivacaine"
- Negation: "No"
- Observation: "able to read"
- Observation: "understand"
- Observation: "singe"